第一型及第二型糖尿病併有微蛋白尿（microalbuminuria）及高血壓時，下列那一種藥可減緩腎病惡化？
A. 鈣離子阻斷劑（calcium channel blocker）
B. ACE 抑制劑（angiotensin converting enzyme inhibitor）
C. α-交感神經阻斷劑（α-blocker）
D. β-交感神經阻斷劑（β- blocker）

正確答案：B. ACE 抑制劑（angiotensin converting enzyme inhibitor）